Clinical trial exclusion criterion:
recurrent contracture in the finger to be treated

Entity relations:
- Has_qualifier("contracture", "finger to be treated")
- Has_qualifier("contracture", "recurrent")